Clinical trial inclusion criteria:
Consecutive 30 female patients presenting to our clinic for brow lifting with botulinum toxin will be randomized to receive one of the two injection techniques

Annotated entities:
- Procedure: "brow lifting"
- Drug: "botulinum toxin"
- Person: "female"
- Multiplier: "30"